60 歲患者有多年運動時呼吸困難之情形，肺功能檢查顯示 FVC：3.0 L（70% predicted），FEV1：1.3 L （40% predicted），FEV1/FVC：43%，TLC：5.6 L（125% predicted），DLCO：54% predicted。此患者最有可能之診斷為下列何者？
A. 氣喘症
B. 肺氣腫
C. 瀰漫性肺纖維化症
D. 鬱血性心衰竭症

正確答案：B. 肺氣腫